Clinical trial exclusion criterion:
All patients receiving a brachial plexus block for anesthesia and/or analgesia

Annotated entities:
- Procedure: "brachial plexus block"